Clinical trial exclusion criterion:
Invasive hepatocellular carcinoma without any isolated tumor

Entity relations:
- Has_qualifier("hepatocellular carcinoma", "Invasive")
- Has_negation("isolated tumor", "without")